Si usted quiere ayudar a mejorar la autoestima del paciente al que trata puede:
1. Utilizar la ventana de Johari para fomentar el autoconocimiento.
2. Conseguir que el yo ideal y el yo real no estén muy próximos.
3. Ayudar a que se centre en sí mismo exclusivamente y que no reconozca la influencia de factores externos.
4. Invitarle a que no interaccione con los demás de forma asertiva.
5. Aunque la persona no quiera ni tenga deseo auténtico de conocerse, no afecta el autoconocimiento.

Respuesta correcta: 1. Utilizar la ventana de Johari para fomentar el autoconocimiento.